Clinical trial exclusion criterion:
Myelodysplastic syndrome or hematological malignancy

Annotated entities:
- Condition: "Myelodysplastic syndrome"
- Condition: "hematological malignancy"